Allergy to amide local anesthetics (lidocaine, bupivacaine, ropivacaine) or opioid (fentanyl).

The above is a clinical trial exclusion criterion. Annotated with entity spans:
[Condition: Allergy] to [Drug: amide local anesthetics] ([Drug: lidocaine], [Drug: bupivacaine], [Drug: ropivacaine]) or [Drug: opioid] ([Drug: fentanyl]).